La insulina:
1. Estimula las reacciones catabólicas.
2. Disminuye el almacenamiento de energía.
3. Ejerce su mecanismo de acción a través de receptores de membrana.
4. Aumenta la concentración de glucosa en sangre.

Respuesta correcta: 3. Ejerce su mecanismo de acción a través de receptores de membrana.